一位 52 歲婦女因下背痛六個月而求醫。最近三個月來病人感覺倦怠、頭痛，理學檢查有貧血、頭部及四肢有壓痛感，實驗室檢查：血紅素（Hb）9.2 gm/dL、紅血球沉降速度（ESR）140 mm/hr、尿酸 7.6 mg/dL、血清總蛋白 12.8 gm/dL、白蛋白 2.5 gm/dL、尿蛋白+++陽性、腰椎 X-ray L4-5 壓迫性骨折，下列那一項是診斷此病最重要之檢查？
A. 血清肌酸酐（creatinine）
B. 胸部 X 光
C. 骨髓穿刺
D. 抗核抗體（ANA）

正確答案：C. 骨髓穿刺